Use of NAC prior to trial (< 1 month of planned surgery)

The above is a clinical trial exclusion criterion. Annotated with entity spans:
Use of [Drug: NAC] [Temporal: prior to trial] ([Temporal: < 1 month] of [Mood: planned] [Procedure: surgery])